Clinical trial inclusion criterion:
Non-smokers (never smoked or not smoking for >6 months with <10 pack years history (Pack years = [cigarettes per day smoked/20] multiplied by number of years smoked).

Entity relations:
- Has_temporal("not smoking", "for >6 months")
- Has_value("pack years", "<10")
- Subsumes("Non-smokers", "never smoked")
- Subsumes("Non-smokers", "pack years")
- OR("never smoked", "not smoking")